Clinical trial inclusion criterion:
Aged at least 18 years with an ability and willingness to give written informed consent.

Entity relations:
- Has_value("Aged", "at least 18 years")